關於酒精相關障礙症（alcohol related disorders）之敘述，下列何者錯誤？
A. 常共病（comorbid）其他物質相關障礙症、反社會型人格障礙症（antisocial personality disorder）、情感
B. 酒精戒斷症候群包括：手抖、焦慮、噁心、幻覺及癲癇發作等
C. 酒精戒斷症候群治療首選為benzodiazepines
D. 使用酒精可幫助入眠，減少睡眠中斷，增加快速動眼期睡眠（REM sleep）及stage 4 sleep

正確答案：D. 使用酒精可幫助入眠，減少睡眠中斷，增加快速動眼期睡眠（REM sleep）及stage 4 sleep